貼膚試驗（patch testing）是診斷接觸性皮膚炎（contact dermatitis）的重要工具，主要目的是：
A. 可作為各類接觸性皮膚炎的確診
B. 找出接觸性過敏原
C. 判斷接觸性皮膚炎的嚴重度
D. 確認發病時間是否超過48小時

正確答案：B. 找出接觸性過敏原